Clinical trial inclusion criterion:
1. Cognitive impairment from mild to moderate degree defined by a Clinical Deterioration Rating (CDR) score range between 0.5 and 2.0.

Annotated entities:
- Condition: "Cognitive impairment"
- Qualifier: "mild to moderate"
- Measurement: "Clinical Deterioration Rating (CDR) score"
- Value: "range between 0.5 and 2.0"
- Parsing_Error: "1."